Clinical trial inclusion criterion:
aged 3-13 years

Entity relations:
- Has_value("aged", "3-13 years")